豬不是下列何種寄生蟲的貯存宿主（reservoir host）？
A. 薑片蟲（Fasciolopsis buski）
B. 日本血吸蟲（Schistosoma japonicum）
C. 埃及血吸蟲（Schistosoma haematobium）
D. 衛氏肺吸蟲（Paragonimus westermani）

正確答案：C. 埃及血吸蟲（Schistosoma haematobium）